Clinical trial exclusion criterion:
Females who are pregnant or nursing.

Annotated entities:
- Person: "Females"
- Condition: "pregnant"
- Condition: "nursing"